Clinical trial exclusion criterion:
Previous treatment with brentuximab vedotin.

Annotated entities:
- Drug: "brentuximab"